Un niño de 4 años de edad sin antecedentes de vacunación frente a la rabia, es atacado espontáneamente por un perro, ocasionándole numerosas heridas en el cuello y las extremidades que llevaba desprotegidas. El animal huye y no es posible localizarlo. ¿Cuál es la actitud inicial a seguir con el paciente para prevenir una posible transmisión de la rabia?
1. Administrar antivíricos específicos frente al virus de la rabia.
2. Administrar la vacuna contra la rabia.
3. Administrar la vacuna más inmunoglobulina antirrábica.
4. Administrar inmunoglobulina antirrábica.
5. Administrar la vacuna, más inmunoglobulina, más antivíricos.

Respuesta correcta: 3. Administrar la vacuna más inmunoglobulina antirrábica.